下列何者最不常用在以細菌來進行的基因工程技術中？
A. DNA gyrase
B. Restriction enzyme
C. DNA ligase
D. Cloning vector

正確答案：A. DNA gyrase